Clinical trial exclusion criterion:
Organ dysfunction, and significant developmental delays or behavior problems

Entity relations:
- Has_qualifier("developmental delays", "significant")
- OR("Organ dysfunction", "behavior problems", "developmental delays")